有關慢性骨髓性白血病（chronic myelogenous leukemia）的敘述，下列何者正確？
A. 病人多數為兒童及青少年
B. 骨髓中的細胞量明顯比正常減少（hypocellular marrow）
C. 病人血液中的骨髓母細胞（myeloblasts）占比超過20%
D. 腫瘤細胞有第9對及第22對染色體轉位，造成BCR-ABL融合基因

正確答案：D. 腫瘤細胞有第9對及第22對染色體轉位，造成BCR-ABL融合基因